Clinical trial exclusion criterion:
Sever renal impairment (S. creatinine more than 3)

Annotated entities:
- Qualifier: "Sever"
- Condition: "renal impairment"
- Measurement: "creatinine"
- Value: "more than 3"